Clinical trial exclusion criterion:
MDRD(Modification of Diet in Renal Disease) Estimated Glomerular filtration rate less than 60 mL / m2

Entity relations:
- Has_value("Estimated Glomerular filtration rate", "less than 60 mL / m2")
- Has_qualifier("Estimated Glomerular filtration rate", "MDRD(Modification of Diet in Renal Disease)")